Kellgren-Lawrence grade I-III

The above is a clinical trial inclusion criterion. Annotated with entity spans:
[Measurement: Kellgren-Lawrence grade] [Value: I-III]